Serum potassium < 3.5 or > 5.1 mEq/L

The above is a clinical trial exclusion criterion. Annotated with entity spans:
[Measurement: Serum potassium] [Value: < 3.5] or [Value: > 5.1 mEq/L]